Women who are breast-feeding

The above is a clinical trial exclusion criterion. Annotated with entity spans:
[Person: Women] who are [Condition: breast-feeding]